El reordenamiento de Cope es un reordenamiento:
1. De un alil vinil éter.
2. [1,3]-sigmatrópico.
3. [1,2]-sigmatrópico.
4. [3,3]-sigmatrópico.
5. Es una cicloadición [4+2].

Respuesta correcta: 4. [3,3]-sigmatrópico.